Una mujer de 35 años consulta por un nódulo tiroideo derecho detectado incidentalmente una mañana al observarse en el espejo un bulto en la cara anterior del cuello. Tras los estudios pertinentes se decide intervenir quirúrgicamente a la paciente realizándose una tiroidectomía total con vaciamiento del componente ganglionar central, siendo el informe del patólogo de nódulo tiroideo de 2,3 cm ocupado en su totalidad por un carcinoma papilar de tiroides, variante células altas, sin infiltración vascular pero sí capsular. Las concentraciones de tiroglobulina 24 h después de la tiroidectomía son de 14 ng/mL. ¿Cuál sería el siguiente paso que usted daría en esta paciente?
1. Remitir de nuevo a la paciente al cirujano para que realice un vaciamiento ganglionar laterocervical derecho.
2. Iniciar tratamiento con una dosis de levotiroxina supresora de TSH y citarla a revisión 6 meses después con una nueva determinación analítica de tiroglobulina y una ecografía cervical.
3. Solicitar un PET-TAC para ver si hay afectación ganglionar.
4. Demorar el inicio del tratamiento sustitutivosupresor de TSH con levotiroxina y remitir la paciente al servicio de Medicina Nuclear para la administración de una dosis ablativa de 100 mCi de I131.

Respuesta correcta: 4. Demorar el inicio del tratamiento sustitutivosupresor de TSH con levotiroxina y remitir la paciente al servicio de Medicina Nuclear para la administración de una dosis ablativa de 100 mCi de I131.